Clinical trial inclusion criterion:
Systolic blood pressure >=160 mm Hg OR a diastolic blood pressure of >=110 mm Hg measured twice more than 15 minutes apart

Annotated entities:
- Measurement: "Systolic blood pressure"
- Value: ">=160 mm Hg"
- Measurement: "diastolic blood pressure"
- Value: ">=110 mm Hg"
- Non-query-able: "measured twice more than 15 minutes apart"